40 歲男性，因全身倦怠而就醫，其抽血結果為 AST：315 IU/L（正常 10～42）；ALT：398 IU/L （正常 10～40），anti-HAV IgM（+），HBsAg（+），anti-HBc IgG（+），anti-HBc IgM（-），anti-HBe 
 Ag（+），anti-HCV（-），則可能診斷為：
A. 慢性 A 型肝炎
B. B 型肝炎帶原合併急性 A 型肝炎
C. B 型肝炎帶原合併急性 C 型肝炎
D. 急性 A 型肝炎合併急性 B 型肝炎

正確答案：B. B 型肝炎帶原合併急性 A 型肝炎